Si obtuviéramos un Coeficiente de Correlación de Pearson de r=0.60 para dos variables “x” e “y” ¿Cuál de estas conclusiones podríamos establecer?
1. Existe una relación causal entre ambas variables de manera que incrementar los valores de la variable “x” en la muestra daría lugar a un incremento de los valores de “y”.
2. Existe una relación causal entre ambas variables de manera que incrementar los valores de la variable “y” en la muestra daría lugar a un incremento de los valores de “x”.
3. El grado de asociación lineal entre ambas variables es del 60 por ciento.
4. Se trata de una correlación lineal con un valor medio, independientemente de la naturaleza de las variables.
5. Existe un patrón de covariación lineal positiva entre ambas variables.

Respuesta correcta: 5. Existe un patrón de covariación lineal positiva entre ambas variables.